Chronic use of vitamin K antagonists or direct thrombin inhibitors, or oral Xa-factor antagonists;

The above is a clinical trial exclusion criterion. Annotated with entity spans:
[Multiplier: Chronic] use of [Drug: vitamin K antagonists] or [Drug: direct thrombin inhibitors], or [Drug: oral Xa-factor antagonists];